Clinical trial inclusion criterion:
The thickness of the nerve must be at least 2 mm in short axis and at least 5 mm in the longitudinal axis.

Entity relations:
- Has_value("thickness of the nerve in short axis", "at least 2 mm")
- Has_value("thickness of the nerve in the longitudinal axis", "at least 5 mm")